一位 1 歲大的幼童至門診就診，家長主訴幼童至今仍無法獨立坐立，無法站立，伸手取物時有奇怪動作，臉部常出現奇怪表情；出生史為足月產出生，產檢無任何異常，但出生後因新生兒高膽紅素血症（hyperbilirubinemia）曾接受照光治療，新生兒篩選除聽力減弱（hearing loss）外，無其他顯著異常，初步診斷為腦性麻痺。他最可能是下列何種腦性麻痺？
A. 低張型（hypotonic type）
B. 徐動型（athetoid type）
C. 痙攣型雙重麻痺（spastic diplegia）
D. 痙攣型四肢麻痺（spastic quadriplegia）

正確答案：B. 徐動型（athetoid type）